30 min or more of (1) continuous clinical seizure activities or (2) recurrent seizure activities without recovery(returning to baseline)between seizures;

The above is a clinical trial inclusion criterion. Annotated with entity spans:
[Multiplier: 30 min or more] of (1) [Temporal: continuous] clinical [Condition: seizure] activities or (2) [Temporal: recurrent] [Condition: seizure] activities [Qualifier: without recovery](returning to baseline)between seizures;